Clinical trial inclusion criterion:
Medical examination performed prior to participation in research

Annotated entities:
- Procedure: "Medical examination"
- Temporal: "prior to participation in research"